Mycoplasma pneumoniae es intrínsecamente resistente a las penicilinas y cefalosporinas por:
1. Carecer de peptidoglicano.
2. Producir beta-lactamasas constitutivamente.
3. Poseer lípidos que impiden la penetración de estos antibióticos.
4. Desarrollar su ciclo vital en el interior de las células eucarióticas.

Respuesta correcta: 1. Carecer de peptidoglicano.